一位中風病人自中風發作後即出現吞嚥障礙，他目前僅能緩慢地吞嚥半固體食物，喝水或果汁時則很容易嗆到。此病人之吞嚥障礙應發生在下列何階段？
A. 口腔階段（oral phase）
B. 咽喉階段（pharyngeal phase）
C. 食道階段（esophageal phase）
D. 鼻腔階段（nasal phase）

正確答案：B. 咽喉階段（pharyngeal phase）